Clinical trial inclusion criterion:
Cr(creatinine) >1.5×ULN.

Annotated entities:
- Measurement: "Cr"
- Measurement: "creatinine"
- Value: ">1.5×ULN"